病房有一因胃癌接受次全胃切除及Billroth-II reconstruction的病人，開始進食後，抱怨進食20～30分鐘後會有噁心 （nausea）、心悸（palpitation）、冒	及腹瀉等症狀，檢查生命跡象後發覺有心搏過速（tachycardia）的情形，最有可能的診斷為何？
A. 輸入環症候群（afferent loop syndrome）
B. 輸出環症候群（efferent loop syndrome）
C. 傾倒症候群（dumping syndrome）
D. 急躁性腸道症候群（irritable bowel syndrome）

正確答案：C. 傾倒症候群（dumping syndrome）